Which transcription factor regulates emergency granulopoiesis?

These data suggest a critical function for C/EBPbeta in emergency granulopoiesis, which demands both differentiation and proliferation of granulocyte precursors.